Clinical trial exclusion criterion:
Patients with cardiac, pulmonary, hepatic, or renal dysfunction, epilepsy, or uncontrolled hypertension, or those taking medications that influence the central nervous system, are excluded from the study. Patients who show obvious alteration of mental status, or refuse to participate, are also excluded from the study.

Annotated entities:
- Condition: "renal dysfunction"
- Condition: "hepatic dysfunction"
- Condition: "pulmonary dysfunction"
- Condition: "cardiac dysfunction"
- Condition: "epilepsy"
- Qualifier: "uncontrolled"
- Condition: "hypertension"
- Drug: "medications that influence the central nervous system"
- Condition: "alteration of mental status"
- Observation: "refuse to participate"
- Informed_consent: "refuse to participate"